Clinical trial exclusion criterion:
Patients who are expected to need systemic antiviral therapy other than that provided by the study at any time during their participation in the study are also excluded. Exception: patients who have had a limited (<=7 days) course of acyclovir for herpetic lesions more than 1 month prior to the first administration of test drug are not excluded.

Annotated entities:
- Mood: "expected to need"
- Procedure: "systemic antiviral therapy"
- Temporal: "at any time during their participation in the study"
- Reference_point: "their participation in the study"
- Drug: "acyclovir"
- Multiplier: "limited course"
- Multiplier: "<=7 days"
- Condition: "herpetic lesions"
- Temporal: "more than 1 month prior to the first administration of test drug"
- Reference_point: "the first administration of test drug"
- Mood: "not excluded"
- Negation: "Exception"